Clinical trial exclusion criterion:
current or past history of psychiatric disease, alcoholism or drug abuse, and other primary sleep disorders

Annotated entities:
- Condition: "psychiatric disease"
- Condition: "alcoholism"
- Condition: "drug abuse"
- Condition: "primary sleep disorders"